Pregnancy, breast feeding or plan to be pregnant woman.

The above is a clinical trial exclusion criterion. Annotated with entity spans:
[Condition: Pregnancy], [Observation: breast feeding] or [Mood: plan to be] [Condition: pregnant] [Person: woman].